Clinical trial inclusion criteria:
Patients undergoing surgeries in the upper limb (arm, forearm or hand)

Annotated entities:
- Procedure: "surgeries"
- Qualifier: "upper limb"
- Qualifier: "arm"
- Qualifier: "forearm"
- Qualifier: "hand"